Una perspona explica a la enfermera que su cuerpo es de madera y pesa mucho. La enfermera interpreta esta frase como:
1. Compulsión.
2. Alucinación.
3. Despersonalización.
4. Obsesión.

Respuesta correcta: 3. Despersonalización.